11. Serum potassium, magnesium, and calcium levels should be at least within institutional normal limits.

The above is a clinical trial inclusion criterion. Annotated with entity spans:
11. [Measurement: Serum potassium], magnesium, and calcium levels should be [Value: at least within institutional normal limits].